Clinical trial inclusion criterion:
Have had >4 emergency department visits within 12 months for 2 consecutive 12-month periods. Period of time can be extended by up to 6 months if incarcerated or institutionalized for ≥ 6 months.

Entity relations:
- Has_multiplier("12-month periods", "2 consecutive")
- Has_temporal("emergency department visits", "within 12 months")
- Has_temporal("emergency department visits", "12-month periods")
- Has_multiplier("emergency department visits", ">4")
- Has_temporal("incarcerated", "extended by up to 6 months")
- OR("incarcerated", "institutionalized")